Clinical trial inclusion criterion:
Any anti-diabetic agent except SGLT2 inhibitors, TZDs(thiazolidinediones), DPP4(Dipeptidyl peptidase4) inhibitors and GLP1 RAs(Glucagon-like Peptide 1-Receptor Agonists)

Entity relations:
- Subsumes("GLP1 RAs", "Glucagon-like Peptide 1-Receptor Agonists")
- Subsumes("DPP4 inhibitors", "Dipeptidyl peptidase4 inhibitors")
- Subsumes("TZDs", "thiazolidinediones")
- Has_negation("SGLT2 inhibitors", "except")
- OR("SGLT2 inhibitors", "TZDs", "DPP4 inhibitors", "GLP1 RAs")